History of intracranial hemorrhage

The above is a clinical trial inclusion criterion. Annotated with entity spans:
History of [Condition: intracranial hemorrhage]